What cellular process is the protein clathrin involved in?

Clathrin is a central regulator of endocytosis in all eukaryotes that plays a role in bacterial and plastid differentiation